Patients undergoing laparoscopic assisted donor nephrectomy

The above is a clinical trial inclusion criterion. Annotated with entity spans:
Patients undergoing [Procedure: laparoscopic assisted donor nephrectomy]